有關先天性膽道閉鎖症（biliary atresia）的敘述，下列何者錯誤？
A. 病人有持續性的黃疸
B. 大便呈灰白色（clay color）
C. 多數病患接受葛西氏手術（Kasai's operation）後預後良好，不需肝臟移植
D. 診斷時需先排除新生兒肝炎（neonatal hepatis）的可能性

正確答案：C. 多數病患接受葛西氏手術（Kasai's operation）後預後良好，不需肝臟移植